下列何者不是誘發 radiocontrast nephropathy 之危險因子？
A. 老年人
B. 腎功能不全病人
C. 糖尿病人
D. 事先服用 acetylcysteine 的病人

正確答案：D. 事先服用 acetylcysteine 的病人